Confirmed testosterone < 100 ng/dL

The above is a clinical trial exclusion criterion. Annotated with entity spans:
[Measurement: Confirmed testosterone] [Value: < 100 ng/dL]